Clinical trial inclusion criterion:
Histologically confirmed primary breast cancer

Entity relations:
- multi("Histologically confirmed", "Histologically")
- Has_qualifier("primary breast cancer", "Histologically confirmed")